Clinical trial exclusion criterion:
Patients with clinically significant mental health issues such as psychosis requiring treatment with antipsychotic medications.

Annotated entities:
- Condition: "mental health issues"
- Condition: "psychosis"
- Drug: "antipsychotic medications"
- Procedure: "treatment"
- Qualifier: "clinically significant"